Dadas tres moléculas de DNA de la misma longitud (A, B y C) y en el mismo solvente, pero con riqueza diferente en cuanto a contenido en G + C (A: 50%; B: 60%; y C: 75%), ¿cómo serían sus temperaturas de fusión (Tm)?:
1. A > B > C.
2. Al estar en el mismo solvente, serían iguales en los tres casos.
3. La molécula C de DNA no pertenecería a una bacteria termófila, dada su menor Tm.
4. C > B > A.
5. No se puede saber con los datos del enunciado.

Respuesta correcta: 4. C > B > A.